Other CNS conditions: non-opportunistic primary or metastatic brain tumors, uncontrolled seizure disorder, progressive multiple sclerosis, stroke with neurological sequelae, or dementia due to causes other than HIV (eg, Alzheimer's disease)

The above is a clinical trial exclusion criterion. Annotated with entity spans:
[Qualifier: Other] [Condition: CNS conditions]: [Qualifier: non-opportunistic] [Qualifier: primary] or [Qualifier: metastatic] [Condition: brain tumors], [Qualifier: uncontrolled] [Condition: seizure disorder], [Condition: progressive multiple sclerosis], [Condition: stroke] with [Condition: neurological sequelae], or [Condition: dementia] due to causes [Negation: other than] [Condition: HIV] (eg, [Condition: Alzheimer's disease])